Clinical trial exclusion criterion:
Severe or uncontrolled hypertension [resting Systolic Blood Pressure (SBP) >180 millimeters of mercury (mmHg), or resting Diastolic Blood Pressure (DBP) >110mmHg at screening period].

Entity relations:
- Has_qualifier("hypertension", "Severe")
- Subsumes(">180 millimeters of mercury", ">180 mmHg")
- Has_index("at screening period", "screening")
- Subsumes("Diastolic Blood Pressure", "DBP")
- Has_value("Diastolic Blood Pressure", ">110mmHg")
- Has_qualifier("Diastolic Blood Pressure", "resting")
- Subsumes("Systolic Blood Pressure", "SBP")
- Has_value("Systolic Blood Pressure", ">180 millimeters of mercury")
- Has_qualifier("Systolic Blood Pressure", "resting")
- AND("hypertension", "Systolic Blood Pressure")
- Has_temporal("Systolic Blood Pressure", "at screening period")
- OR("Severe", "uncontrolled")
- OR("Systolic Blood Pressure", "Diastolic Blood Pressure")